Clinical trial inclusion criterion:
BMI < 40 kg/m2

Entity relations:
- Has_value("BMI", "< 40 kg/m2")